Clinical trial exclusion criterion:
Concomitant participation in another clinical study

Annotated entities:
- Observation: "participation in another clinical study"
- Temporal: "Concomitant"